Clinical trial exclusion criterion:
Systemic treatment with aminosides in the last 15 days

Annotated entities:
- Procedure: "Systemic treatment"
- Drug: "aminosides"
- Temporal: "in the last 15 days"